下列有關第三型過敏反應（type Ⅲ hypersensitivity）的敘述，何者錯誤？
A. 是因為免疫複合物所造成的反應
B. 會活化補體而導致組織的破壞
C. 亞瑟氏反應（Arthus reaction）是第三型過敏反應的一種
D. 接觸性皮膚炎是其中的代表疾病

正確答案：D. 接觸性皮膚炎是其中的代表疾病